Clinical trial exclusion criterion:
At high risk, in the opinion of the Investigator, for meningococcal disease during the trial

Annotated entities:
- Non-query-able: "At high risk, in the opinion of the Investigator, for meningococcal disease during the trial"
- Subjective_judgement: "At high risk, in the opinion of the Investigator, for meningococcal disease during the trial"